Un hombre de 32 años natural de Camerún consulta por fiebre tos y dolor en hemitórax izquierdo de 1 mes de evolución. Tomó durante 1 semana amoxicilina-clavulánico sin mejoría de los síntomas. Se le realiza un análisis donde destaca una cifra de leucocitos de 8000/microL y una hemoglobina de 12,8 g/dL. En la radiografía de tórax se observa un derrame pleural izquierdo loculado que ocupa un tercio del hemitórax. Una toracentesis muestra un líquido amarillento con las siguientes características: hematíes 2000/µL, leucocitos 2500/µL con 90% de linfocitos, proteínas 4,9 g/dL, lactato deshidrogenasa 550 U/L, glucosa 67 mg/dL y ausencia de células malignas en el estudio citológico. ¿Cuál de las siguientes pruebas sería más útil para diagnosticar la causa del derrame pleural?
1. Una tomografía computarizada (TC) torácica.
2. Medición del pH del líquido pleural.
3. Medición de la adenosina desaminasa del líquido pleural.
4. Prueba de la tuberculina.

Respuesta correcta: 3. Medición de la adenosina desaminasa del líquido pleural.